English or Spanish speaking

The above is a clinical trial inclusion criterion. Annotated with entity spans:
[Observation: English] or [Observation: Spanish speaking]